Chronic intake of CNS active drugs

The above is a clinical trial inclusion criterion. Annotated with entity spans:
[Multiplier: Chronic intake] of [Drug: CNS active drugs]